Clinical trial exclusion criterion:
History of suicidal behavior or suicidal ideation as indicated by the C-SSRS, administered at screening (the questionnaire is provided in Appendix 4), and as per investigator's judgment.

Entity relations:
- OR("suicidal behavior", "suicidal ideation")